Clinical trial exclusion criterion:
Current or planned incarceration or other involuntary detention

Annotated entities:
- Temporal: "Current"
- Mood: "planned"
- Observation: "incarceration"
- Observation: "involuntary detention"